Researchers believe that the situation is unsuitable for participation in the group

The above is a clinical trial exclusion criterion. Annotated with entity spans:
[Non-query-able: Researchers believe that the situation is unsuitable for participation in the grou]p